Clinical trial exclusion criterion:
chromosome aberrations in anyone of the couple.

Annotated entities:
- Condition: "chromosome aberrations"
- Observation: "anyone of the couple"
- Qualifier: "anyone of the couple"